Serum aminotransferase (AST or ALT) 3x upper limit of normal or higher

The above is a clinical trial exclusion criterion. Annotated with entity spans:
[Measurement: Serum aminotransferase] ([Measurement: AST] or [Measurement: ALT]) [Value: 3x upper limit of normal or higher]